13 歲大女孩挨罵後突發抽搐，以下何者能確定屬於假性抽搐（pseudoseizure）？
A. 磁共振（magnetic resonance, MR）檢查無異常
B. 腦脊髓液（cerebrospinal fluiod, CSF）無異常
C. 抽搐時腦波無異常變化
D. 靜脈注射 diazepam 後抽搐止住

正確答案：C. 抽搐時腦波無異常變化